¿Cuál de los siguientes patógenos bacterianos posee cápsula?:
1. Clostridium botulinum.
2. Treponema pallidum.
3. Helicobacter pylori.
4. Haemophilus influenzae.

Respuesta correcta: 4. Haemophilus influenzae.